Parturients presented for Cesarean section

The above is a clinical trial inclusion criterion. Annotated with entity spans:
[Condition: Parturients] presented for [Measurement: Cesarean section]